Clinical trial inclusion criterion:
At least 20/200 corrected visual acuity

Annotated entities:
- Value: "At least 20/200"
- Measurement: "corrected visual acuity"